Skin infections at the inclusion visit

The above is a clinical trial exclusion criterion. Annotated with entity spans:
[Condition: Skin infections] [Temporal: at the inclusion visit]